一位58歲男性因急性胸痛，伴隨冷	來急診求助，當下安排之檢查，下列何者較不適當？
A. 胸部電腦斷層
B. 抽血測心肌酵素
C. 運動心電圖
D. 心導管冠狀動脈攝影

正確答案：C. 運動心電圖